What is the chromosomal abnormality associated with Klinefelter Syndrome

About 1 in 650 boys are born with an extra X chromosome (47,XXY or Klinefelter syndrome)